La inestabilidad de los microtúbulos significa que:
1. Son lábiles.
2. Crecen por un extremo y se acortan por el otro.
3. Tienen tendencia a experimentar fragmentación.
4. Alternan fases de crecimiento con periodos de acortamiento.

Respuesta correcta: 4. Alternan fases de crecimiento con periodos de acortamiento.